Female subjects of childbearing potential must agree to use highly effective birth control methods.

The above is a clinical trial inclusion criterion. Annotated with entity spans:
[Person: Female] subjects of [Condition: childbearing potential] must agree to use highly effective [Procedure: birth control methods].